¿Con qué suele asociarse la cataplejía característica de la narcolepsia?
1. Con parálisis de sueño.
2. Con emociones intensas.
3. Con alucinaciones hipnagógicas e hipnopómpicas.
4. Con somnolencia diurna.
5. Con horarios irregulares.

Respuesta correcta: 2. Con emociones intensas.